Currently undertaking other treatment that may affect the safety and/or efficacy evaluation, e.g. beta receptors agonists, et cetera.

The above is a clinical trial exclusion criterion. Annotated with entity spans:
[Non-query-able: Currently undertaking other treatment that may affect the safety and/or efficacy evaluation], e.g. [Drug: beta receptors agonists], et cetera.